羅醫師參與一項疼痛控制新藥的人體試驗，以骨折病患為對象進行雙盲研究，發現新藥效果相當優良。實驗還在進行當中，數名由羅醫師主治的患類風濕關節炎患者雖不符合參與實驗的條件，然因其長期受慢性疼痛之苦又加上舊藥止痛效果不佳，羅醫師遂決定將此類仍在試驗階段，我國衛生福利部尚未正式核可的新藥，但在獲得病人知情同意後，將此新藥應用在病患身上。羅醫師如此行為可能是基於什麼倫理原則？
A. 尊重自主原則
B. 行善原則
C. 不傷害原則
D. 正義原則

正確答案：B. 行善原則